Alcoholism

The above is a clinical trial exclusion criterion. Annotated with entity spans:
[Condition: Alcoholism]